Clinical trial inclusion criterion:
2. No history of traumatic brain injury of sufficient severity to have resulted in medical attention (ascertained via the Ohio State University TBI Identification Questionnaire—OSU TBI-ID)

Entity relations:
- Has_negation("traumatic brain injury", "No")
- Has_temporal("traumatic brain injury", "history")
- Has_qualifier("traumatic brain injury", "sufficient severity")
- Has_value("Ohio State University TBI Identification Questionnaire—OSU TBI-ID", "sufficient severity")